劉先生，50 歲，身高 170 公分，體重 68 公斤，是一家貿易公司的老闆，偶爾會與客戶交際應酬，少量喝酒，一天約抽 2 包香菸，無特殊疾病，平常也無服用中西藥物，家族中有糖尿病與高血壓的病史。最近在家血壓測量約 160/90 mmHg，並出現暈眩與左半側麻痺的症狀，經檢查後診斷為短暫性腦缺血發作。以下有關香菸與腦中風的敘述，何者錯誤？
A. 吸菸者比非吸菸者中風發生率高約 50%
B. 低膽固醇血症對吸菸者發生腦中風具有保護作用
C. 吸菸者有高血壓發生腦中風的危險性約為正常人的 20 倍
D. 中風的危險性在戒菸 5 年後降至與不吸菸者相同

正確答案：B. 低膽固醇血症對吸菸者發生腦中風具有保護作用